下列中腦何結構由翼板（alar plate）所發育而來？
A. 動眼神經核（oculomotor nucleus）
B. 大腦腳（cerebral peduncle）
C. 下丘（inferior colliculus）
D. 內縱束（medial longitudinal fasciculus）

正確答案：C. 下丘（inferior colliculus）